unstable condition, COPD exacerbation

The above is a clinical trial exclusion criterion. Annotated with entity spans:
[Qualifier: unstable] [Condition: condition], [Condition: COPD exacerbation]